Clinical trial exclusion criterion:
preoperative SpO2 less than 93%

Annotated entities:
- Temporal: "preoperative"
- Measurement: "SpO2"
- Value: "less than 93%"